Clinical trial inclusion criterion:
Positive HBs Ag

Entity relations:
- Has_value("HBs Ag", "Positive")